Sobre la malnutrición en el anciano, ¿Cuál de las siguientes afirmaciones NO es correcta?:
1. Una albumina por debajo de 2,5 g/dl se considera señal de malnutrición grave.
2. Las medidas antropométricas son signos tardíos de malnutrición y no identifican la malnutrición inicial.
3. Una obtención de una puntuación de 16 puntos en el Mini Nutritional Assesmen test (MNA) completo es indicativa de riesgo de malnutrición.
4. La albumina es el marcador bioquímico más utilizado para determinar el estado nutricional.

Respuesta correcta: 3. Una obtención de una puntuación de 16 puntos en el Mini Nutritional Assesmen test (MNA) completo es indicativa de riesgo de malnutrición.